Clinical trial exclusion criterion:
DSM-V diagnosis of a lifetime history of psychotic spectrum disorder

Annotated entities:
- Qualifier: "DSM-V"
- Temporal: "lifetime history"
- Condition: "psychotic spectrum disorder"